Patient must not have had a corticosteroid injection in the SI joint within the last three months

The above is a clinical trial inclusion criterion. Annotated with entity spans:
Patient must [Negation: not] have had a [Procedure: corticosteroid injection] in the [Qualifier: SI joint] [Temporal: within the last three months]